Clinical trial exclusion criterion:
Severe respiratory and circulatory system diseases.

Annotated entities:
- Condition: "circulatory system disease"
- Condition: "respiratory system disease"
- Qualifier: "Severe"